下列何者是髕骨肌腱承重套筒（patellar tendon-bearing socket）的壓力承受位置？
A. 脛骨前肌群（pretibial muscles）
B. 腓骨頭部（fibular head）
C. 膕旁腱（hamstring tendon）
D. 脛骨結節（tibial tubercle）

正確答案：A. 脛骨前肌群（pretibial muscles）